第四頸髓功能失常引起四肢癱瘓的病人，可以從事下列何種活動？
A. 自行淋浴
B. 使用湯匙進食
C. 自行轉位由輪椅到床上
D. 使用特殊電動輪椅

正確答案：D. 使用特殊電動輪椅